Serum creatinine greater than 3 times ULN.

The above is a clinical trial exclusion criterion. Annotated with entity spans:
[Measurement: Serum creatinine] [Value: greater than 3 times ULN].